El desarrollo de los fármacos genéricos se basa en la evaluación de la bioequivalencia del genérico en comparación con un producto de referencia ya comercializado. Este concepto se refiere a:
1. La evaluación de la equivalencia en ensayos clínicos de eficacia.
2. Lla evaluación de la similitud en ensayos clínicos de tolerancia.
3. La equivalencia en el proceso de distribución de un fármaco y por tanto, a la comprobación de que se encuentra con las mismas concentraciones en el lugar de acción.
4. La     evaluación    de     la   equivalencia farmacocinética.
5. La comprobación de un efecto similar de los factores que influyen en la biodisponibilidad de un fármaco.

Respuesta correcta: 4. La     evaluación    de     la   equivalencia farmacocinética.